Clinical trial inclusion criterion:
American Society of Anesthesiologists Status 1 -3

Entity relations:
- Has_value("American Society of Anesthesiologists Status", "1 -3")